La reacción entre una cetona y un reactivo de Grignard origina, tras hidrolizarse la sal formada, un:
1. Éster carboxílico.
2. Alcohol.
3. Éter.
4. Aldehído.
5. Acido carboxílico.

Respuesta correcta: 2. Alcohol.